self-reported healthy adults between the ages of 18-60 who are fluent in English.

The above is a clinical trial inclusion criterion. Annotated with entity spans:
[Qualifier: self-reported] [Condition: healthy] [Person: adults] [Value: between] the [Person: ages] of 18-60 who are [Observation: fluent in English].